下列有關萊姆病（Lyme disease）之敘述，何者錯誤？
A. 為人畜共通之疾病
B. 致病原為 Treponema pallidum
C. 可用 PCR 方法檢測檢體中致病原之 DNA
D. 可用血清學之方式檢測病人體內之抗體

正確答案：B. 致病原為 Treponema pallidum